Clinical trial exclusion criterion:
Uncorrected obstructive or severe regurgitant valve disease, nondilated cardiomyopathy, or significant systemic ventricular outflow obstruction

Entity relations:
- Has_qualifier("obstructive valve disease", "Uncorrected")
- Has_qualifier("regurgitant valve disease", "severe")
- Has_qualifier("systemic ventricular outflow obstruction", "significant")
- OR("obstructive valve disease", "systemic ventricular outflow obstruction", "regurgitant valve disease", "nondilated cardiomyopathy")